Why is lock mass used in Orbitrap measurements?

The lock mass is a compound of known mass and is used to compensate for drifts in instrument calibration.